received telbivudine as the antiviral therapy or have received more than one NA in the past.

The above is a clinical trial exclusion criterion. Annotated with entity spans:
received [Drug: telbivudine] as the [Procedure: antiviral therapy] or have received [Multiplier: more than one] [Condition: NA] [Temporal: in the past].